Clinical trial inclusion criterion:
3. Agree to participant in the trial.

Annotated entities:
- Post-eligibility: "Agree to participant in the trial."
- Non-query-able: "Agree to participant in the trial."